Clinical trial exclusion criterion:
Using valproate

Annotated entities:
- Drug: "valproate"